Clinical trial inclusion criterion:
(2)A diagnosis or previous diagnosis of essential hypertension, including anyone currently taking antihypertensive drugs; or for those who have not taken antihypertensive drugs within the last 2 weeks, two consecutive examinations were conducted at least one day apart, and both sitting blood pressure (mean value of 3 measurements) met the following criteria: diastolic blood pressure (DBP) =90 mmHg or systolic blood pressure (SBP) =140 mmHg (the second blood pressure was measured at V1);

Annotated entities:
- Temporal: "previous"
- Mood: "diagnosis"
- Condition: "essential hypertension"
- Drug: "antihypertensive drugs"
- Drug: "antihypertensive drugs"
- Negation: "not"
- Temporal: "within the last 2 weeks"
- Multiplier: "two consecutive at least one day apart"
- Procedure: "sitting blood pressure"
- Measurement: "diastolic blood pressure (DBP)"
- Value: "=90 mmHg"
- Measurement: "systolic blood pressure (SBP)"
- Value: "=140 mmHg"
- Temporal: "currently"
- Non-representable: "(the second blood pressure was measured at V1)"